patients who need suturing for laceration under procedural anesthesia using ketamine

The above is a clinical trial inclusion criterion. Annotated with entity spans:
patients who need [Procedure: suturing] for [Condition: laceration] under [Procedure: procedural anesthesia] using [Drug: ketamine]